7. Normal laboratory values or clinically insignificant findings at screening as determined by the Investigator;

The above is a clinical trial inclusion criterion. Annotated with entity spans:
[Parsing_Error: 7.] [Condition: Normal laboratory values] or [Qualifier: clinically insignificant] [Condition: findings] [Temporal: at screening] [Subjective_judgement: as determined by the Investigator];